Subject and parent/legally acceptable representative (if applicable) able to attend all scheduled visits and to comply with all trial procedures.

The above is a clinical trial inclusion criterion. Annotated with entity spans:
[Non-query-able: Subject and parent/legally acceptable representative (if applicable) able to attend all scheduled visits and to comply with all trial procedures.]